Clinical trial exclusion criterion:
Severe liver disease (including ALT or AST=2.5-fold the normal upper limit), biliary obstruction;

Annotated entities:
- Condition: "liver disease"
- Qualifier: "Severe"
- Measurement: "AST"
- Measurement: "ALT"
- Value: "=2.5-fold the normal upper limit"
- Condition: "biliary obstruction"